History or renal transplantation

The above is a clinical trial exclusion criterion. Annotated with entity spans:
[Temporal: History] or [Measurement: renal transplantation]